Which residue of alpha-synuclein was found to be phosphorylated in Lewy bodies?

Alpha-synuclein phosphorylated at serine 129 (S129) is highly elevated in Parkinsons disease patients where it mainly accumulates in the Lewy bodies